有關生長荷爾蒙（GH）之敘述中，下列何者最正確？
A. 其又名 somatomedin
B. 其構造與泌乳激素（prolactin）類似
C. 其在白天之分泌量最高
D. 來自牛類之生長荷爾蒙在臨床廣泛使用

正確答案：B. 其構造與泌乳激素（prolactin）類似